Clinical trial inclusion criterion:
Expected survival time=3 months;

Annotated entities:
- Observation: "Expected survival time="
- Value: "3 months"